¿Cuál de los siguientes criterios NO corresponde a alguno de los nueve establecidos en el Modelo de la Fundación Europea para la Gestión de la Calidad (EFQM):
1. Liderazgo.
2. Personas.
3. Procesos, productos y servicios.
4. Eficiencia.
5. Resultados clave.

Respuesta correcta: 4. Eficiencia.